Clinical trial exclusion criterion:
Currently take bisphosphonates, estrogen replacement therapy, glucocorticosteroids, or other drugs affecting bone

Entity relations:
- OR("bisphosphonates", "estrogen replacement therapy", "glucocorticosteroids", "drugs affecting bone")